ErbB1 致癌基因（oncogene）的產物為 human epidermal growth factor receptor 1（HER1），屬於 receptor tyrosine kinases（RTKs）家族成員。人類癌症中常發現 ErbB1 基因的過度表現，這可能為癌細胞不正常增殖、抗凋亡以及轉移的機制。若要發展對這類癌症的「標靶治療」（target therapy），由你對 RTK signaling 之認識來判斷，下列何者可能不是有效標靶治療藥劑？
A. 可抑制 epidermal growth factor（EGF）與 HER1 結合的單株抗體
B. 可與 HER1 之 extracellular EGF-binding domain 結合，而不引起 intracellular kinase domain 活化的單株抗體
C. 可引發 HER1 dimerization 的單株抗體
D. 可自由穿越細胞膜而 block HER1 intracellular kinase domain 上 ATP-binding site 的小分子化合物

正確答案：C. 可引發 HER1 dimerization 的單株抗體